uterine size <12 weeks.

The above is a clinical trial inclusion criterion. Annotated with entity spans:
[Measurement: uterine size] [Value: <12 weeks].